Previously taken one or more statins

The above is a clinical trial inclusion criterion. Annotated with entity spans:
Previously taken [Multiplier: one or more] [Drug: statins]